1. Signed informed consent

The above is a clinical trial inclusion criterion. Annotated with entity spans:
[Parsing_Error: 1.] [Post-eligibility: Signed informed consent]